下列何者為肝癌之主要轉移部位？
A. 胃及腸
B. 胃及胰
C. 腹部淋巴結及肺
D. 腹部淋巴結及腎

正確答案：C. 腹部淋巴結及肺